Clinical trial inclusion criterion:
Received a new or ongoing prescription for at least one SGA (i.e., olanzapine, clozapine, risperidone, quetiapine, aripiprazole, ziprasidone, iloperidone, lurasidone, paliperidone, brexpiprazole or cariprazine) that is not prescribed as a PRN medication;

Entity relations:
- Has_multiplier("SGA", "at least one")
- Subsumes("SGA", "olanzapine")
- OR("olanzapine", "clozapine", "risperidone", "quetiapine", "aripiprazole", "ziprasidone", "iloperidone", "lurasidone", "paliperidone", "brexpiprazole", "cariprazine")